If entering the study as an inpatient, hospitalization was recent

The above is a clinical trial inclusion criterion. Annotated with entity spans:
If entering the study as an [Visit: inpatient], [Visit: hospitalization] was [Temporal: recent]